¿Cuál es la causa más frecuente de síndrome vertiginoso?
1. Enfermedad de Ménière.
2. Neurinoma del acústico.
3. Vértigo posicional paroxístico.
4. Neuronitis vestibular viral.

Respuesta correcta: 3. Vértigo posicional paroxístico.